Ladd procedure是下列何種疾病的手術方法?
A. 小腸閉鎖（intestinal atresia）
B. 十二指腸閉鎖（duodenal atresia）
C. 巨大結腸症（Hirschsprung's disease）
D. 腸扭轉異常（anomalies of intestinal rotation）

正確答案：D. 腸扭轉異常（anomalies of intestinal rotation）